2. Cephalic presentation

The above is a clinical trial inclusion criterion. Annotated with entity spans:
[Parsing_Error: 2.] [Condition: Cephalic presentation]